Clinical trial inclusion criterion:
Diagnosis of prostate adenocarcinoma histologically confirmed at MSKCC.

Entity relations:
- Has_value("histologically", "confirmed")
- multi("histologically confirmed", "histologically")
- Has_qualifier("prostate adenocarcinoma", "histologically confirmed")